有關人類多瘤病毒（Human polyomavirus）的敘述，下列何者錯誤？
A. 包括BK病毒及JC病毒
B. 不具有外	膜（envelope）
C. JC病毒感染免疫不全病人，常造成去髓鞘（demyelination）病變
D. T抗原可以活化p53，促進細胞死亡

正確答案：D. T抗原可以活化p53，促進細胞死亡